La ecuación de Nernst:
1. Se cumple tanto para celdas galvánicas reversibles como altamente irreversibles.
2. Permite calcular la fuerza electromotriz de una celda galvánica con solo conocer la energía de Gibbs estándar de la reacción química de la celda.
3. Depende únicamente de las actividades de las especies que participan en la reacción química de la celda.
4. Relaciona la fuerza electromotriz de la celda con las actividades de las especies que participan en la reacción química de la celda y con el potencial estándar de la reacción.
5. Es independiente del número de electrones transferidos en la reacción electroquímica de la celda

Respuesta correcta: 4. Relaciona la fuerza electromotriz de la celda con las actividades de las especies que participan en la reacción química de la celda y con el potencial estándar de la reacción.